Clinical trial exclusion criterion:
Hypersensitivity to Heparin or its derivatives.

Entity relations:
- AND("Hypersensitivity", "Heparin")